At high risk, in the opinion of the Investigator, for meningococcal disease during the trial

The above is a clinical trial exclusion criterion. Annotated with entity spans:
[Non-query-able: At high risk, in the opinion of the Investigator, for meningococcal disease during the trial]